Living in a nursing home.

The above is a clinical trial exclusion criterion. Annotated with entity spans:
[Observation: Living] in a [Visit: nursing home].